Clinical trial inclusion criteria:
non-valvular atrial fibrillation
nondiabetic patients
type 1 and 2 diabetic patients

Annotated entities:
- Condition: "atrial fibrillation"
- Qualifier: "non-valvular"
- Condition: "diabetic"
- Negation: "non"
- Condition: "diabetic"
- Qualifier: "type 1"
- Qualifier: "type 2"